¿Cómo se denomina el tipo de placenta que llega hasta el borde del Orificio Cervical Interno (OCI) sin sobrepasarlo?:
1. Placenta previa oclusiva parcial.
2. Placenta previa oclusiva total.
3. Placenta previa marginal.
4. Placenta previa lateral o de inserción baja.

Respuesta correcta: 3. Placenta previa marginal.